Term singleton infants (>37 weeks gestational age)

The above is a clinical trial inclusion criterion. Annotated with entity spans:
[Condition: Term] [Condition: singleton infants] ([Value: >37 weeks] [Measurement: gestational age])